在一側腎動脈結紮，另一側腎臟切除與否下，血中腎素（renin）濃度的變化情形為何？
A. 另一側腎臟切除下，腎素濃度上升；另一側腎臟保留下，腎素濃度不變
B. 另一側腎臟切除下，腎素濃度上升；另一側腎臟保留下，腎素濃度上升
C. 另一側腎臟切除下，腎素濃度不變；另一側腎臟保留下，腎素濃度上升
D. 另一側腎臟切除下，腎素濃度下降；另一側腎臟保留下，腎素濃度上升

正確答案：C. 另一側腎臟切除下，腎素濃度不變；另一側腎臟保留下，腎素濃度上升